List the blood group antigens, associated with blood type

The blood group antigens, associated with blood type, are: ab, von willebrand factor, o, a, de ritis, rhesus, b, factor vii, platelets.